Clinical trial exclusion criteria:
Contraindications to empagliflozin, Sitagliptin
DPP4 inhibitors or Sodium-glucose cotransporter-2(SGLT2) inhibitors within the previous 4 weeks
Insulin requiring diabetes
Poor glucose control (HbA1C>10 %)
Acute coronary syndrome
Stent placement within the previous 6 months
Previous coronary artery bypass graft surgery within the previous 6 months
Planned revascularization within 6 months
Heart failure requiring loop diuretics
Severe left ventricular hypertrophy (left ventricular septal wall thickness > 13mm)
Significant renal disease manifested by creatinine clearance of < 30 ml/min)
Hepatic disease or biliary tract obstruction, or significant hepatic enzyme elevation (alanine transaminase or Aspartate Aminotransferase > 3 times upper limit of normal)
Radiopaque material implanted in the chest wall (metal, silicone, etc.)
Contraindication to adenosine stress test
Any clinically significant abnormality identified at the screening visit, physical examination, laboratory tests, or electrocardiogram which, in the judgment of the Investigator, would preclude safe completion of the study.
Patient's pregnant or breast-feeding or child-bearing potential
Expected life expectancy < 1 year
Unwillingness or inability to comply with the procedures described in this protocol

Annotated entities:
- Condition: "Contraindications"
- Drug: "empagliflozin"
- Drug: "Sitagliptin"
- Drug: "DPP4 inhibitors"
- Drug: "Sodium-glucose cotransporter-2(SGLT2) inhibitors"
- Temporal: "within the previous 4 weeks"
- Drug: "Insulin"
- Procedure: "diabetes"
- Condition: "Poor glucose control"
- Measurement: "HbA1C"
- Value: ">10 %"
- Condition: "Acute coronary syndrome"
- Device: "Stent"
- Procedure: "placement"
- Temporal: "within the previous 6 months"
- Temporal: "within the previous 6 months"
- Procedure: "coronary artery bypass graft surgery"
- Temporal: "Previous"
- Procedure: "revascularization"
- Temporal: "within 6 months"
- Mood: "Planned"
- Condition: "Heart failure"
- Drug: "loop diuretics"
- Condition: "left ventricular hypertrophy"
- Qualifier: "Severe"
- Measurement: "left ventricular septal wall thickness"
- Value: "> 13mm"
- Qualifier: "Significant"
- Condition: "renal disease"
- Measurement: "creatinine clearance"
- Value: "< 30 ml/min"
- Condition: "Hepatic disease"
- Condition: "biliary tract obstruction"
- Condition: "hepatic enzyme elevation"
- Qualifier: "significant"
- Measurement: "alanine transaminase"
- Measurement: "Aspartate Aminotransferase"
- Value: "> 3 times upper limit of normal"
- Device: "Radiopaque material"
- Qualifier: "chest wall"
- Procedure: "adenosine stress test"
- Condition: "Contraindication"
- Post-eligibility: "Any clinically significant abnormality identified at the screening visit, physical examination, laboratory tests, or electrocardiogram which, in the judgment of the Investigator, would preclude safe completion of the study."
- Condition: "pregnant"
- Condition: "breast-feeding"
- Condition: "child-bearing potential"
- Observation: "Expected life expectancy"
- Value: "< 1 year"
- Non-query-able: "Unwillingness or inability to comply with the procedures described in this protocol"